¿Cuál de las siguientes características es aplicable a la ATP-sintasa mitocondrial?:
1. Se la denomina también F0F1ATPasa.
2. Las subunidades que sintetizan ATP se encuentran en la porción F0, orientadas hacia la matriz mitocondrial.
3. Las subunidades que sintetizan ATP se encuentran en la porción F1 y están orientadas hacia el espacio de intermembranas.
4. Para la síntesis de ATP, los protones fluyen desde la matriz al espacio de intermembrana, entrando por el canal que forman las subunidades C de la porción F0.

Respuesta correcta: 1. Se la denomina también F0F1ATPasa.